下列何者是類鴉片類（opioids）藥物的純粹拮抗劑（pure antagonist）？
A. nalbuphine
B. butorphanol
C. naloxone
D. pentazocine

正確答案：C. naloxone